下列關於甲狀腺手術前的照護，何者錯誤？
A. Graves' disease病人，手術前給予Lugol's iodine solution
B. hyperthyroidism病人，先給予抗甲狀腺藥物
C. 常規手術應給予預防性抗生素
D. 聲音嘶啞的病人，手術前應做laryngoscopy

正確答案：C. 常規手術應給予預防性抗生素